Clinical trial exclusion criterion:
Currently dependent on any substance other than cannabis, alcohol or nicotine;

Entity relations:
- Has_negation("cannabis", "other than")
- AND("substance", "cannabis")
- AND("dependent", "substance")
- OR("cannabis", "alcohol", "nicotine")